有關胰臟管的敘述，下列何項錯誤？
A. 主要胰臟管又名為 duct of Wirsung
B. 在胰臟體部的管徑大小為 0.9-2.4 mm
C. 若無胰臟炎發生，隨著年齡增加，胰臟管徑會隨之增加
D. Duct of Santorini 通常會在 duct of Wirsung 的遠側直接開口入十二指腸

正確答案：D. Duct of Santorini 通常會在 duct of Wirsung 的遠側直接開口入十二指腸